Clinical trial exclusion criterion:
Clinically significant, uncontrolled cardiac arrhythmia, unstable angina, congestive heart failure (NYHA Class 3 or 4), or history of myocardial infarction in the preceding 2 years.

Annotated entities:
- Condition: "cardiac arrhythmia"
- Qualifier: "uncontrolled"
- Condition: "unstable angina"
- Condition: "congestive heart failure"
- Measurement: "NYHA Class"
- Value: "3"
- Value: "4"
- Condition: "myocardial infarction"
- Temporal: "preceding 2 years"